¿Cuál de los siguientes aspectos es nuclear para el diagnostico (DSM-IV-TR y DSM 5) del trastorno de Estrés Postraumático?:
1. Disociación.
2. Reexperimentación.
3. Distorsiones cognitivas.
4. Amnesia (total o parcial) del acontecimiento traumático.

Respuesta correcta: 2. Reexperimentación.